Clinical trial exclusion criterion:
Known levetiracetam allergy

Entity relations:
- AND("allergy", "levetiracetam")